Clinical trial exclusion criterion:
(2)History of allergies to enalapril, folic acid or other components of the compound drug;

Entity relations:
- AND("allergies", "enalapril")
- Has_temporal("allergies", "History")
- OR("enalapril", "components of the compound drug", "folic acid")